Preoperative anticoagulation therapy

The above is a clinical trial exclusion criterion. Annotated with entity spans:
[Temporal: Preoperative] [Procedure: anticoagulation therapy]